Hemodynamic or respiratory instability requiring inotropic support, mechanical ventilation or mechanical heart assistance within 30 days of screening evaluation.

The above is a clinical trial exclusion criterion. Annotated with entity spans:
[Condition: Hemodynamic] or [Condition: respiratory instability] requiring [Procedure: inotropic support], [Procedure: mechanical ventilation] or [Procedure: mechanical heart assistance] [Temporal: within 30 days of screening evaluation].